當男性準備要射精時，下列何現象不會發生？
A. 外尿道括約肌（external urethral sphincter）收縮
B. 前列腺（prostate gland）收縮
C. 輸精管（ductus deferens）收縮
D. 球尿道腺（bulbourethral gland）收縮

正確答案：A. 外尿道括約肌（external urethral sphincter）收縮